Normal renal function.

The above is a clinical trial inclusion criterion. Annotated with entity spans:
[Qualifier: Normal] [Condition: renal function].